Clinical trial exclusion criterion:
Previous participation in an HIV vaccine trial. Participants that were documented to have received only placebo are not excluded.

Entity relations:
- Has_context("participation", "HIV vaccine trial")
- Has_temporal("participation", "Previous")
- Has_temporal("Participants", "Previous")
- Has_context("Participants", "HIV vaccine trial")
- AND("Participants", "placebo")
- Has_mood("Participants", "not")